某研究者想探討失業率與自殺率的關係，所以在 319 縣市中收集去年之年平均失業率與年平均自殺率資料，下面統計分析方法何者最恰當？
A. 線性迴歸（Linear Regression）
B. 變異數分析（ANOVA）
C. 羅吉斯迴歸（Logistic Regression）
D. 列聯表分析（Contingency Table）

正確答案：A. 線性迴歸（Linear Regression）